signed informed consent.

The above is a clinical trial inclusion criterion. Annotated with entity spans:
[Non-query-able: signed informed consent].